下列那一種疾病最容易造成遠端指關節（distal inter-phalangeal joint）發炎？
A. 骨性（osteoarthritis）關節炎
B. 類風濕（rheumatoid）關節炎
C. 血友病（hemophilic）關節炎
D. 痛風性（gouty）關節炎

正確答案：A. 骨性（osteoarthritis）關節炎